What is the chromosomal location of the LDL receptor gene associated with autosomal dominant Familial Hypercholesterolemia?

The chromosomal location of the LDL receptor gene associated with autosomal dominant Familial Hypercholesterolemia is chromosome 19q13.3.